Clinical trial exclusion criterion:
Any MS relapse in the last five years, as determined at the screen visit by the PI

Annotated entities:
- Condition: "MS"
- Condition: "relapse"
- Temporal: "in the last five years"